Clinical trial exclusion criterion:
require combination immunotherapy

Entity relations:
- Has_mood("combination immunotherapy", "require")